4. Patients with previous radiotherapy as definitive therapy for locally advanced non-small cell lung cancer are eligible, as long as the recurrence is outside the original radiation therapy port. Radiation therapy must have been completed >4 weeks prior to the initiation of study treatment. Patients who have received chemo/radiation for locally advanced NSCLC are not eligible. Patients who have received palliative radiation therapy for symptomatic metastases must have completed treatment >14 days prior the initiation of the study treatment.

The above is a clinical trial inclusion criterion. Annotated with entity spans:
4. Patients with [Temporal: previous] [Procedure: radiotherapy] as definitive therapy for [Qualifier: locally advanced] [Condition: non-small cell lung cancer] are eligible, as long as [Non-representable: the recurrence is outside the original radiation therapy port]. [Procedure: Radiation therapy] must have been completed [Temporal: >4 weeks prior to the initiation of study treatment]. Patients who have received [Procedure: chemo]/[Procedure: radiation] for [Qualifier: locally advanced] [Condition: NSCLC] are [Negation: not] eligible. Patients who have received [Procedure: palliative radiation therapy] for [Condition: symptomatic metastases] must have completed treatment [Temporal: >14 days prior the initiation of the study treatment].